Clinical trial exclusion criterion:
11. Stroke still requiring neurological rehabilitation.

Annotated entities:
- Parsing_Error: "11."
- Procedure: "neurological rehabilitation"
- Condition: "Stroke"
- Non-query-able: "requiring"
- Subjective_judgement: "requiring"
- Qualifier: "requiring"